¿Qué modelo teórico explicativo de las conductas de salud enfatiza la importancia de la percepción de susceptibilidad personal a la enfermedad y de su severidad?:
1. Modelo Transteórico.
2. Modelo de Acción Razonada.
3. Modelo de Creencias de Salud.
4. Modelo PRECEDE-PORCEED.
5. Modelo de Competencia.

Respuesta correcta: 3. Modelo de Creencias de Salud.